下列何種黴菌主要感染途徑不是吸入感染？
A. Coccidioides immitis
B. Candida glabrata
C. Histoplasma capsulatum
D. Blastomyces dermatitidis

正確答案：B. Candida glabrata